Clinical trial exclusion criterion:
Current abnormal blood panel (assessed by comprehensive metabolic panel, lipid panel and complete blood count).

Entity relations:
- Has_value("blood panel", "abnormal")
- Has_temporal("blood panel", "Current")
- Subsumes("blood panel", "metabolic panel")
- Subsumes("blood panel", "lipid panel")
- Subsumes("blood panel", "complete blood count")